Señale la respuesta correcta respecto al control hormonal de la reproducción:
1. La hormona liberadora de gonadotropinas (GnRH) de la hipófisis controla la secreción de dos gonadotropinas del lóbulo anterior del hipotálamo.
2. Las gonadotropinas son la hormona foliculoestimulante (FSH) y la hormona luteinizantes (LH).
3. La FSH actúa principalmente sobre las células endocrinas, estimulando la síntesis de hormonas sexuales.
4. La LH es necesaria, junto con las hormonas sexuales esteroideas, para iniciar y mantener la gametogénesis.
5. Todas las anteriores son correctas.

Respuesta correcta: 2. Las gonadotropinas son la hormona foliculoestimulante (FSH) y la hormona luteinizantes (LH).